De novo kidney transplants

The above is a clinical trial inclusion criterion. Annotated with entity spans:
[Qualifier: De novo] [Procedure: kidney transplants]